以下何種膀胱病灶最常發生FGFR3基因突變？
A. 非侵襲性低惡性度泌尿上皮癌（noninvasive low-grade papillary urothelial carcinoma）
B. 非侵襲性高惡性度泌尿上皮癌（noninvasive high-grade papillary urothelial carcinoma）
C. 原位癌（carcinoma in situ）
D. 侵襲性高惡性度泌尿上皮癌（invasive high-grade papillary urothelial carcinoma）

正確答案：A. 非侵襲性低惡性度泌尿上皮癌（noninvasive low-grade papillary urothelial carcinoma）